Clinical trial exclusion criterion:
11. History of learning disability or current ADHD

Entity relations:
- Has_temporal("ADHD", "current")
- Has_temporal("learning disability", "History")
- OR("learning disability", "ADHD")